Clinical trial exclusion criterion:
Subject suffers from any condition, such as swallowing problems, that precludes compliance with study and/or device instructions.

Annotated entities:
- Condition: "condition"
- Condition: "swallowing problems"
- Negation: "precludes"
- Informed_consent: "compliance with study"
- Informed_consent: "compliance with device instructions"